胰島素瘤（insulinoma）的臨床診斷為Whipple triad ，即：
A. 低血糖症狀、血糖低於50 mg/dL及有服用糖尿病藥物史
B. 低血糖症狀、血糖低於50 mg/dL及口服葡萄糖後可改善症狀
C. 低血糖症狀、血糖低於50 mg/dL及靜脈注射葡萄糖後可改善症狀
D. 低血糖症狀、血糖低於50 mg/dL及有使用胰島素注射史

正確答案：C. 低血糖症狀、血糖低於50 mg/dL及靜脈注射葡萄糖後可改善症狀